16. Severe anemia (Hb <10 mg/dL).

The above is a clinical trial exclusion criterion. Annotated with entity spans:
[Parsing_Error: 16.] [Qualifier: Severe] [Condition: anemia] ([Measurement: Hb] [Value: <10 mg/dL]).